Temperature less than 100.4 F

The above is a clinical trial inclusion criterion. Annotated with entity spans:
[Measurement: Temperature] [Value: less than 100.4 F]